Clinical trial inclusion criterion:
Women aged 20-49;

Entity relations:
- Has_value("aged", "20-49")